Clinical trial inclusion criterion:
Age>18 years.

Annotated entities:
- Person: "Age"
- Value: ">18 years."